tolerance of parenteral or enteral nutrition

The above is a clinical trial inclusion criterion. Annotated with entity spans:
[Condition: tolerance] of [Procedure: parenteral] or [Procedure: enteral nutrition]